Had a serious infection, has been hospitalized for an infection, or has been treated with IV antibiotics for an infection within 2 months prior to Baseline

The above is a clinical trial exclusion criterion. Annotated with entity spans:
Had a [Condition: serious infection], has been [Procedure: hospitalized] for an [Condition: infection], or has been treated with [Drug: IV antibiotics] for an [Condition: infection] [Temporal: within 2 months prior to Baseline]